What is the function of the dormancy survival regulator (DosR) in Mycobacterium tuberculosis?

During this phase, at least 48 genes, collectively named Dormancy survival regulator (DosR) regulon, are important for the long-term survival of bacilli under a non-respiring state.